Clinical trial exclusion criterion:
Patients with other factors causing liver diseases.

Annotated entities:
- Non-representable: "Patients with other factors causing liver diseases"